Clinical trial inclusion criterion:
GOLD 1: FEV1=0.80 and FEV1/FVC < 0.70

Annotated entities:
- Measurement: "GOLD"
- Value: "1"
- Measurement: "FEV1"
- Value: "=0.80"
- Measurement: "FEV1/FVC"
- Value: "< 0.70"